Clinical trial inclusion criterion:
Borg dyspnea score > 3 during the 3-min constant rate shuttle walking test at V3

Annotated entities:
- Measurement: "Borg dyspnea score"
- Value: "> 3"
- Temporal: "3-min constant rate shuttle walking test"
- Qualifier: "V3"